Clinical trial inclusion criterion:
Able and willing to comply with all pre- and follow-up testing and requirements

Annotated entities:
- Post-eligibility: "ble and willing to comply with all pre- and follow-up testing and requirements"